All adult patients 18 years of age or older admitted to the intensive care units of St. Boniface General Hospital with a diagnosis of acute pulmonary blastomycosis requiring mechanical ventilation.

The above is a clinical trial inclusion criterion. Annotated with entity spans:
All [Person: adult] patients [Value: 18 years] of [Person: age] or older [Procedure: admitted] to the [Visit: intensive care units] of [Visit: St. Boniface General Hospital] with a diagnosis of [Condition: acute pulmonary blastomycosis] requiring [Procedure: mechanical ventilation].